左心房黏液瘤發生時，其腫瘤常以一短莖（Stalk）黏附於左心房的那一部位？
A. 二尖瓣之瓣葉上
B. 心房中隔壁
C. 肺靜脈開口處
D. 左心耳部

正確答案：B. 心房中隔壁